pregnancy or baby nursing period or un-contracepted child bearing period woman.

The above is a clinical trial exclusion criterion. Annotated with entity spans:
[Observation: pregnancy] or [Observation: baby nursing period] or [Negation: un-][Procedure: contracepted] [Observation: child bearing period] [Person: woman].